18 - 64 years old

The above is a clinical trial inclusion criterion. Annotated with entity spans:
[Value: 18 - 64 years] [Person: old]